運動中扭傷腳踝，第一時間應如何處理？
A. 施予按摩
B. 繼續運動以維持韌帶彈性
C. 立即熱敷以增進血液循環
D. 立即冰敷以減輕疼痛腫脹

正確答案：D. 立即冰敷以減輕疼痛腫脹